Clinical trial exclusion criterion:
Self reported renal disease (severe impaired renal function)

Annotated entities:
- Qualifier: "Self reported"
- Condition: "renal disease"
- Qualifier: "severe"
- Condition: "impaired renal function"